有關哮吼（Croup）的描述，下列何者最正確？
A. 哮吼是以細菌感染為主
B. 通常會有喘息聲（Wheezing）
C. 其臨床呼吸道症狀為聲門下方或聲帶處的軟組織水腫所致
D. 哭鬧可協助患者維持充足的換氣動作，所以不必刻意安撫

正確答案：C. 其臨床呼吸道症狀為聲門下方或聲帶處的軟組織水腫所致